Active syphilis or treatment for syphilis within 90 days prior to study entry. NOTE: Active syphilis is defined as four-fold increase in serum rapid plasma reagin (RPR) or venereal disease research laboratory (VDRL) tests in an individual with past syphilis, or newly reactive serum RPR or VDRL with a reactive confirmatory test (enzyme immunoassays [EIA] or chemiluminescent assay [CIA], T. pallidum particle agglutination [TP-PA], or fluorescent treponemal antibody absorbed [FTA-ABS]).

The above is a clinical trial exclusion criterion. Annotated with entity spans:
[Temporal: Active] [Condition: syphilis] or [Procedure: treatment] for [Condition: syphilis] [Temporal: within 90 days prior to study entry]. NOTE: [Temporal: Active] [Condition: syphilis] is defined as [Value: four-fold increase] in [Measurement: serum rapid plasma reagin (RPR)] or [Measurement: venereal disease research laboratory (VDRL)] tests in an individual with [Temporal: past] [Condition: syphilis], or [Temporal: newly] [Value: reactive] [Measurement: serum RPR] or [Measurement: VDRL] with a [Procedure: reactive confirmatory test] ([Procedure: enzyme immunoassays [EIA]] or [Procedure: chemiluminescent assay [CIA]], [Procedure: T. pallidum particle agglutination [TP-PA]], or [Procedure: fluorescent treponemal antibody absorbed [FTA-ABS]]).